Clinical trial exclusion criterion:
Acute coronary syndrome, stroke, transient ischaemic attack, cardiac, carotid, or other major cardiovascular surgery, percutaneous coronary intervention, or carotid angioplasty within the 3 months.

Entity relations:
- Has_temporal("major cardiovascular surgery", "within the 3 months")
- OR("major cardiovascular surgery", "percutaneous coronary intervention", "carotid angioplasty")
- OR("Acute coronary syndrome", "cardiac", "transient ischaemic attack", "stroke", "major cardiovascular surgery", "carotid")